Clinical trial exclusion criterion:
Current use of any medication, including antiretrovirals, prohibited in the study (refer to the A5324 protocol-specific web page [PSWP] for the prohibited medications)

Annotated entities:
- Drug: "medication"
- Drug: "antiretrovirals"
- Qualifier: "prohibited in the study"
- Temporal: "Current"